Clinical trial exclusion criterion:
patients with comorbidities (heart failure congestive, chronic obstructive pulmonary disease);

Annotated entities:
- Condition: "comorbidities"
- Condition: "heart failure congestive"
- Condition: "chronic obstructive pulmonary disease"